CYP2C9 substrates such as tolbutamide (because of expected inhibition of the metabolism of CYP2C9 substrates by venetoclax. It is recommended to exclude CYP2C9 substrates with a narrow therapeutic index such as phenytoin.

The above is a clinical trial exclusion criterion. Annotated with entity spans:
[Drug: CYP2C9 substrates] such as [Drug: tolbutamide] (because of expected inhibition of the metabolism of CYP2C9 substrates by venetoclax. [Subjective_judgement: It is recommended to exclude CYP2C9 substrates with a narrow therapeutic index such as phenytoin].